Patients with inflammatory arthritis

The above is a clinical trial exclusion criterion. Annotated with entity spans:
Patients with [Condition: inflammatory arthritis]